Clinical trial exclusion criterion:
Receipt of immune globulins, blood or blood-derived products in the past 3 months

Annotated entities:
- Drug: "immune globulins"
- Drug: "blood"
- Drug: "blood-derived products"
- Temporal: "in the past 3 months"